Clinical trial exclusion criterion:
Gastric outlet obstruction or intestinal obstruction

Annotated entities:
- Condition: "Gastric outlet obstruction"
- Condition: "intestinal obstruction"